幽門螺旋桿菌（Helicobacter pylori）已知是部分消化道疾病的致病因子，下列何者除外？
A. 胃食道逆流（reflux esophagitis）
B. 萎縮性胃炎（atrophic gastritis）
C. B細胞胃淋巴癌（B cell gastric lymphoma）
D. 十二指腸潰瘍（duodenal ulcer）

正確答案：A. 胃食道逆流（reflux esophagitis）